Upper limb bites

The above is a clinical trial exclusion criterion. Annotated with entity spans:
[Qualifier: Upper limb] [Condition: bites]